Clinical trial exclusion criterion:
Subjects who have been recently active (>30 min of moderate/high intensity exercise, 2 times/week).

Annotated entities:
- Temporal: "recently"
- Condition: "active"
- Value: ">30 min"
- Measurement: "moderate/high intensity exercise"
- Multiplier: "2 times/week"